Allergic to the medications

The above is a clinical trial exclusion criterion. Annotated with entity spans:
[Condition: Allergic] to the [Drug: medications]